Clinical trial exclusion criterion:
Allergy to ascorbic acid

Annotated entities:
- Drug: "ascorbic acid"
- Condition: "Allergy"